Clinical trial inclusion criterion:
Premenopausal women

Annotated entities:
- Person: "Premenopausal"
- Person: "women"